nondiabetic as defined by fasting plasma glucose <126 mg/dL

The above is a clinical trial inclusion criterion. Annotated with entity spans:
[Condition: nondiabetic] as defined by [Measurement: fasting plasma glucose] [Value: <126 mg/dL]